Clinical trial exclusion criterion:
Awaiting cardiac transplantation or other cardiac surgery within the next 12 months (365 days)

Entity relations:
- Subsumes("within the next 12 months", "within the next 365 days")
- Has_temporal("cardiac transplantation", "within the next 12 months")
- OR("cardiac transplantation", "cardiac surgery")